Severe heart failure or cardiogenic shock

The above is a clinical trial exclusion criterion. Annotated with entity spans:
[Qualifier: Severe] [Condition: heart failure] or [Condition: cardiogenic shock]